Which gene mutations are responsible for isolated Non-compaction cardiomyopathy?

cardiac β-myosin heavy chain gene (MYH7)
c.349G>A (p.D117N) in the ZASP gene
mutation in the isoform-1 specific region of the DSP C-terminus
pE96K mutation in the cardiac troponin T gene (TNNT2)